History of allergic or hypersensitivity reaction to ascorbic acid products

The above is a clinical trial exclusion criterion. Annotated with entity spans:
History of [Condition: allergic] or [Condition: hypersensitivity] reaction to [Drug: ascorbic acid] products